Clinical trial exclusion criterion:
taken any structured behavioral or exercise programs in the past 3 months

Annotated entities:
- Procedure: "structured exercise programs"
- Procedure: "structured behavioral programs"
- Temporal: "in the past 3 months"